Which growth factors are known to be involved in the induction of EMT?

EMT is characterized by acquisition of cell motility, modifications of cell morphology, and cell dissociation correlating with the loss of desmosomes from the cellular cortex. A number of growth factors have been shown to be involved in this process. These include fibroblast growth factors (FGFs), TGF-β1, TGF-β2, TNF-α, CCN family, Sonic Hedgehog (SHh), Notch1, GF-β, Wnt, EGF, bFGF, IGF-I and IGF-II.